scheduled for Nuss procedure for pectus excavatum correction

The above is a clinical trial inclusion criterion. Annotated with entity spans:
[Mood: scheduled] for [Procedure: Nuss procedure] for [Condition: pectus excavatum] correction